Clinical trial inclusion criterion:
Patients may have received 1-3 prior systemic therapies in the metastatic setting.

Entity relations:
- Has_qualifier("systemic therapies", "metastatic setting")
- Has_temporal("systemic therapies", "prior")
- Has_multiplier("systemic therapies", "1-3")